Clinical trial inclusion criterion:
3. Surface ulcer with an area > 15cm2 post debridement

Entity relations:
- AND("Surface ulcer", "area post debridement")
- Has_value("area post debridement", "> 15cm2")